Clinical trial exclusion criterion:
difficult to follow up or patients with poor compliance.

Annotated entities:
- Non-query-able: "difficult to follow up or patients with poor compliance."